¿Qué nombre recibe el episodio con síntomas psicóticos que se produce tras una fuerte intoxicación alcohólica en la que el individuo ha estado consumiendo dosis grandes de alcohol durante varios días?
1. Delirium tremens.
2. Amnesias parciales.
3. Alucinosis alcohólica.
4. síndrome de abstinencia.
5. Síndrome de Korsakoff.

Respuesta correcta: 3. Alucinosis alcohólica.